Clinical trial exclusion criterion:
Lesions in or close to scar tissue (< 1cm)

Annotated entities:
- Condition: "Lesions"
- Qualifier: "in or close to scar tissue"
- Value: "< 1cm"